Clinical trial inclusion criterion:
Has an acceptable history of NSAID use

Entity relations:
- Has_temporal("NSAID", "history")
- Has_qualifier("NSAID", "acceptable")